Clinical trial exclusion criterion:
Cyclosporine; St. John's Wort; Efavirenz; Phenytoin; Carbamazepine; Bosentan; HIV protease inhibitors; modafinil; ketoconazole; or rifampin use within 7 days of enrollment

Entity relations:
- Has_index("within 7 days of enrollment", "enrollment")
- Has_temporal("Cyclosporine", "within 7 days of enrollment")
- OR("Cyclosporine", "St. John's Wort", "Efavirenz", "Phenytoin", "Carbamazepine", "Bosentan", "HIV protease inhibitors", "modafinil", "ketoconazole", "rifampin")